Clinical trial exclusion criterion:
A clinical diagnosis of influenza within the previous 12 months

Entity relations:
- Has_temporal("influenza", "within the previous 12 months")